下列有關中華肝吸蟲（Clonorchis sinensis）感染人體的敘述，何者錯誤？
A. 因食入帶蟲淡水魚肉而感染
B. 其囊幼（metacercaria）具感染人體之能力
C. 其蟲卵易與橫川吸蟲（Metagonimus yokogawai）蟲卵區分
D. 在慢性重度感染者可能引發膽管癌

正確答案：C. 其蟲卵易與橫川吸蟲（Metagonimus yokogawai）蟲卵區分